Clinical trial inclusion criterion:
Unexplained infertility.

Entity relations:
- Has_qualifier("infertility", "Unexplained")